¿Cuál de los siguientes aspectos diferencia el trastorno de pánico de una fobia específica, según el DSM (IV-TR y 5)?:
1. La presencia de ataques de pánico.
2. La intensidad de los ataques de pánico (mayor en el trastorno de pánico).
3. Los síntomas presentes durante el ataque de pánico.
4. El tipo de ataque de pánico: inesperado en el trastorno de pánico, y situacional en la fobia.

Respuesta correcta: 4. El tipo de ataque de pánico: inesperado en el trastorno de pánico, y situacional en la fobia.